Clinical trial exclusion criteria:
Contraindications for spinal anesthesia (like bleeding diathesis or regional infection at site of neuroaxial block)
Known allergy to Granisetron or local anaesthetic (heavy bupivacaine, Marcaine Spinal 0.5% Heavy, 5mg/ml, AstraZeneca ampule)
Pregnancy induced hypertension
Congenital or rheumatic heart diseases
Antepartum haemorrhage
Fetal destress or gestational age < 36 week

Annotated entities:
- Condition: "Contraindications"
- Procedure: "spinal anesthesia"
- Condition: "bleeding diathesis"
- Condition: "regional infection"
- Qualifier: "site of neuroaxial block"
- Condition: "allergy"
- Drug: "Granisetron"
- Drug: "local anaesthetic"
- Drug: "heavy bupivacaine"
- Drug: "Marcaine Spinal 0.5% Heavy"
- Qualifier: "5mg/ml"
- Qualifier: "AstraZeneca ampule"
- Condition: "Pregnancy"
- Condition: "hypertension"
- Qualifier: "Pregnancy induced"
- Qualifier: "Congenital"
- Qualifier: "rheumatic"
- Condition: "heart diseases"
- Condition: "Antepartum haemorrhage"
- Condition: "Fetal destress"
- Measurement: "gestational age"
- Value: "< 36 week"